Unstable vital sign before surgery

The above is a clinical trial exclusion criterion. Annotated with entity spans:
[Qualifier: Unstable] [Condition: vital sign] [Temporal: before surgery]